28 歲女性，G3P3，姙娠 30 週，分娩早產男嬰一名，新生兒膚色全身與四肢藍紫，依阿帕格氏計分法（Apgar score），於膚色之分項下得分為何？
A. 0
B. 1
C. 2
D. 3

正確答案：A. 0